Clinical trial exclusion criterion:
History of hypersensitivity/intolerance to any components of the study inhalers (example, lactose, magnesium stearate). In addition, subjects with a history of severe milk protein allergy that, in the opinion of the study physician, contraindicates participation will also be excluded.

Entity relations:
- Subsumes("components of the study inhalers", "lactose")
- AND("hypersensitivity", "components of the study inhalers")
- AND("allergy", "milk protein")
- Has_qualifier("allergy", "severe")
- Has_temporal("allergy", "history")
- AND("allergy", "contraindicates participation")
- OR("lactose", "magnesium stearate")
- OR("hypersensitivity", "intolerance")
- OR("hypersensitivity", "allergy")